Clinical trial exclusion criterion:
Absence of documentation in the medical record of clinical remission for the last 6 months

Annotated entities:
- Negation: "Absence of"
- Condition: "clinical remission"
- Temporal: "for the last 6 months"